Toll-like receptor 4 是辨識細菌的何種成分？
A. lipopeptide
B. lipopolysaccharide
C. DNA
D. RNA

正確答案：B. lipopolysaccharide